一位 60 歲男性病人，端坐時感覺呼吸困難，躺平時即獲得緩解，下列何者為最可能的診斷？
A. 心臟衰竭
B. 肺梗塞（pulmonary embolism）
C. 肝肺症候群（hepato-pulmonary syndrome）
D. 糖尿病合併酮酸中毒（diabetic ketoacidosis）

正確答案：C. 肝肺症候群（hepato-pulmonary syndrome）